Asthma or Chronic Obstructive pulmonary Disease

The above is a clinical trial exclusion criterion. Annotated with entity spans:
[Condition: Asthma] or [Condition: Chronic Obstructive pulmonary Disease]